Clinical trial inclusion criteria:
Term singleton infants (>37 weeks gestational age)
Birth weight > 2500g
Healthy at inclusion
Breastfed exclusively or predominantly (>50% meals) at inclusion
No previous iron supplementation
No previous blood transfusion
Informed consent given

Annotated entities:
- Condition: "singleton infants"
- Condition: "Term infants"
- Value: ">37 weeks"
- Measurement: "gestational age"
- Measurement: "Birth weight"
- Value: "> 2500g"
- Condition: "Healthy"
- Temporal: "at inclusion"
- Condition: "Breastfed"
- Qualifier: "exclusively"
- Qualifier: "predominantly"
- Multiplier: ">50% meals"
- Temporal: "at inclusion"
- Negation: "No"
- Temporal: "previous"
- Procedure: "iron supplementation"
- Negation: "No"
- Temporal: "previous"
- Procedure: "blood transfusion"
- Informed_consent: "Informed consent given"